Clinical trial exclusion criterion:
11. Uncontrolled diabetes with recent weight loss, diabetic coma, or frequent insulin reactions;

Annotated entities:
- Parsing_Error: "11."
- Condition: "diabetes"
- Qualifier: "Uncontrolled"
- Condition: "weight loss"
- Condition: "diabetic coma"
- Condition: "insulin reactions"
- Multiplier: "frequent"